Clinical trial exclusion criterion:
Depressed liver function

Entity relations:
- Has_value("liver function", "Depressed")
- multi("Depressed liver function", "liver function")